Clinical trial exclusion criterion:
Women who are known to be pregnant.

Annotated entities:
- Person: "Women"
- Condition: "pregnant"